Which is the major clinical feature observed in FDXR-associated disease?

FDXR-associated disease is a phenotypically heterogeneous disorder with retinal dystrophy being a major clinical feature observed in this cohort.